Clinical trial exclusion criterion:
Presence of coagulation disorders

Annotated entities:
- Condition: "coagulation disorders"